Clinical trial inclusion criterion:
Disease limited to the liver Unresectable disease by surgery or other local therapies

Annotated entities:
- Observation: "Disease limited to the liver"
- Condition: "Unresectable disease"
- Procedure: "surgery"
- Procedure: "local therapies"
- Qualifier: "other"